Measurable disease

The above is a clinical trial inclusion criterion. Annotated with entity spans:
[Condition: Measurable disease]